Clinical trial inclusion criterion:
3. Designated venous leg ulcer meets the following criteria at both the screening and baseline visits. If the patient has multiple ulcers, at least one ulcer must meet the following criteria at both the screening and baseline visits:

Annotated entities:
- Parsing_Error: "3."
- Condition: "venous leg ulcer"
- Parsing_Error: "Designated venous leg ulcer meets the following criteria at both the screening and baseline visits."
- Condition: "ulcers"
- Multiplier: "multiple"
- Multiplier: "at least one"
- Condition: "ulcer"
- Parsing_Error: "If the patient has multiple ulcers, at least one ulcer must meet the following criteria at both the screening and baseline visits:"